Age group = 18 ys.

The above is a clinical trial inclusion criterion. Annotated with entity spans:
[Person: Age group] [Value: = 18 ys].